the history of severe inoculation allergies

The above is a clinical trial exclusion criterion. Annotated with entity spans:
the [Temporal: history] of [Qualifier: severe] [Condition: inoculation allergies]